Clinical trial exclusion criterion:
Morbid obesity (BMI> 40 kg / m2).

Entity relations:
- Has_value("BMI", "> 40 kg / m2")
- Subsumes("Morbid obesity", "BMI")